4. Pregnant women

The above is a clinical trial exclusion criterion. Annotated with entity spans:
[Parsing_Error: 4.] [Condition: Pregnant] [Person: women]